額骨（frontal bone）與鼻骨（nasal bone）之交會點稱為：
A. 眉間（glabella）
B. 星點（asterion）
C. 鼻根點（nasion）
D. 翼點（pterion）

正確答案：C. 鼻根點（nasion）